El cartílago fibroso es típico de:
1. Tráquea.
2. Bronquios.
3. Pabellón auricular
4. Discos intervertebrales.
5. Conducto auditivo externo.

Respuesta correcta: 4. Discos intervertebrales.